Which thyroid hormone transporter is implicated in thyroid hormone resistance syndrome?

thyroid hormone transporter MCT8 is implicated in thyroid hormone resistance syndrome